Which key gene is involved in syndromic obesity phenotype of patients with 1p21.3 microdeletions?

MIR137 is the key gene mediator of the syndromic obesity phenotype of patients with 1p21.3 microdeletions.